Clinical trial exclusion criterion:
Prior CABG.

Annotated entities:
- Temporal: "Prior"
- Procedure: "CABG"